下列那一項不是青光眼乙型阻斷劑（β-blocker）降眼壓藥物的副作用？
A. 睫毛變長
B. 血壓下降
C. 心跳變慢
D. 支氣管痙攣

正確答案：A. 睫毛變長